Clinical trial exclusion criterion:
Subjects who creatinine value is more than two times of the upper limit of the normal range at screening test

Annotated entities:
- Measurement: "creatinine"
- Value: "more than two times of the upper limit of the normal range"
- Temporal: "at screening test"
- Reference_point: "screening test"